Un hombre de 45 años, diagnosticado de hipertensión, ha iniciado un tratamiento en monoterapia para disminuir resistencias periféricas y prevenir la retención de CINa y agua. El paciente ha desarrollado tos persistente. ¿Cuál de los siguientes fármacos tendría idénticas acciones beneficiosas al que ya usa, pero sin producir tos al paciente?:
1. Losartán.
2. Nifedipino.
3. Prazosín.
4. Propranolol.
5. Enalaprilo.

Respuesta correcta: 1. Losartán.